Clinical trial exclusion criterion:
inability to give informed written consent;

Annotated entities:
- Informed_consent: "inability to give informed written consent;"